小腸上皮細胞外高濃度鈉離子可促進葡萄糖吸收的原因為何？
A. 葡萄糖運送蛋白（GLUT2）為一種鈉離子通道
B. 葡萄糖和鈉離子共用運送蛋白（SGLT1）
C. 葡萄糖以鈉離子依賴性的促進性擴散（facilitated diffusion）方式被吸收
D. 葡萄糖須先與鈉離子結合成錯化合物才能被吸收

正確答案：B. 葡萄糖和鈉離子共用運送蛋白（SGLT1）